Clinical trial inclusion criterion:
Endometrial thickness = 7 mm after stimulation

Annotated entities:
- Measurement: "Endometrial thickness"
- Value: "= 7 mm"
- Temporal: "after stimulation"
- Procedure: "stimulation"
- Reference_point: "stimulation"